Clinical trial inclusion criterion:
Age >18 years old

Entity relations:
- Has_value("Age", ">18 years old")